El empaquetamiento cúbico compacto de aniones con los cationes ocupando todos los huecos tetraédricos, a qué estructura tipo corresponde:
1. Fluorita.
2. Antifluorita.
3. Rutilo.
4. Cloruro de cesio.

Respuesta correcta: 2. Antifluorita.